Clinical trial inclusion criteria:
1. Have a finding of a mass lesion on mammography or breast MRI (BIRADS 0, 4 or 5) that is >0.5 cm and < 2 cm in size and has had or will have additional workup with focused ultrasound.
2. Have a finding of a mass lesion on ultrasound (BIRADS 0, 4 or 5) that is > 0.5 cm and < 2 cm in size.
3. Have a positive finding on MBI that is < 2 cm in size and requires additional diagnostic workup with focused ultrasound.

Annotated entities:
- Condition: "mass lesion"
- Procedure: "mammography"
- Procedure: "breast MRI"
- Measurement: "BIRADS"
- Value: "0, 4 or 5"
- Value: ">0.5 cm and < 2 cm"
- Measurement: "size"
- Non-query-able: "has had or will have additional workup with focused ultrasound"
- Condition: "mass lesion"
- Procedure: "ultrasound"
- Measurement: "BIRADS"
- Value: "0, 4 or 5"
- Value: "> 0.5 cm and < 2 cm"
- Measurement: "size"
- Grammar_Error: "MBI"
- Procedure: "MBI"
- Condition: "positive finding"
- Undefined_semantics: "positive finding"
- Value: "< 2 cm"
- Measurement: "size"
- Undefined_semantics: "requires additional diagnostic workup with focused ultrasound"
- Subjective_judgement: "requires additional diagnostic workup with focused ultrasound"